Does dasatinib promote or inhibit T-cell proliferation?

Dasatinib inhibits T-cell proliferation